Clinical trial exclusion criterion:
Patients treated with drugs metabolized by the CYP2D6 pathway.

Annotated entities:
- Non-query-able: "Patients treated with drugs metabolized by the CYP2D6 pathway"